Clinical trial exclusion criterion:
Current wheeze

Annotated entities:
- Condition: "wheeze"